ASA status I or II

The above is a clinical trial inclusion criterion. Annotated with entity spans:
[Measurement: ASA status] [Value: I or II]